Clinical trial inclusion criterion:
Having a regular menstrual cycle of which the menstrual period is between day 3-7, and the period between day 25-35;

Entity relations:
- Has_value("menstrual period", "between day 3-7")
- v-AND("menstrual period", "and")
- OR("between day 3-7", "between day 25-35")